Subject has been diagnosed with rheumatoid arthritis or other autoimmune disease.

The above is a clinical trial exclusion criterion. Annotated with entity spans:
Subject has been diagnosed with [Condition: rheumatoid arthritis] or [Qualifier: other] [Condition: autoimmune disease].